Clinical trial exclusion criterion:
Significant head trauma.

Entity relations:
- Has_qualifier("head trauma", "Significant")